Contraindication to vaginal delivery

The above is a clinical trial exclusion criterion. Annotated with entity spans:
[Condition: Contraindication] to [Procedure: vaginal delivery]